一位 60 歲之長期洗腎患者，因發燒、白血球過多而住院，胸部 X 光顯示為多葉性肺炎，且尿液之退伍軍人肺炎菌之抗原檢查為陽性，請問使用下列何種抗生素最為適當？
A. 四環黴素（tetracycline）
B. 青黴素（penicillin）
C. 紅黴素（erythromycin）
D. 頭芽孢菌素（cephalosporin）

正確答案：C. 紅黴素（erythromycin）